with at least 1 sound and fully erupted permanent first molar

The above is a clinical trial inclusion criterion. Annotated with entity spans:
with [Multiplier: at least 1] [Qualifier: sound] and [Qualifier: fully erupted] [Condition: permanent first molar]